Clinical trial exclusion criterion:
Clinically significant pulmonary disease.

Annotated entities:
- Condition: "pulmonary disease"
- Qualifier: "Clinically significant"